En la nucleación homogénea:
1. Si las partículas sólidas formadas bajo solidificación tienen un radio menor que el radio crítico, la energía del sistema será más baja si su tamaño aumenta.
2. Si las partículas sólidas formadas bajo solidificación tienen un radio menor que el radio crítico, la energía del sistema será más baja si se redisuelve.
3. Si las partículas sólidas formadas bajo solidificación tienen un radio mayor que el radio crítico, la energía del sistema será más baja si se redisuelve.
4. Si las partículas sólidas formadas bajo solidificación tienen un radio igual al crítico, la energía del sistema será más baja si se redisuelve.
5. No existe relación alguna entre el radio crítico y la tendencia a crecer de tamaño o redisolverse.

Respuesta correcta: 2. Si las partículas sólidas formadas bajo solidificación tienen un radio menor que el radio crítico, la energía del sistema será más baja si se redisuelve.